Clinical trial exclusion criteria:
Do not sign informed consent
Pregnant patients
Liver cirrhosis
Undifferentiated adenocarcinoma.
cT4
Metastatic disease (M1)
chronic renal failure on dialysis
ASA IV
BMI <18 and> 35 kg / m2

Annotated entities:
- Observation: "Do not sign informed consent"
- Condition: "Pregnant"
- Condition: "Liver cirrhosis"
- Condition: "adenocarcinoma"
- Qualifier: "Undifferentiated"
- Condition: "cT4"
- Condition: "Metastatic disease (M1)"
- Condition: "chronic renal failure"
- Procedure: "dialysis"
- Measurement: "ASA"
- Value: "IV"
- Measurement: "BMI"
- Value: "<18 and> 35 kg / m2"